部分皮層植皮之供皮區是靠下列所述之細胞癒合，何者除外？
A. 汗腺（sweat gland）
B. 毛囊（hair follicle）
C. 皮脂腺（sebaceous gland）
D. 脂肪細胞（lipocyte）

正確答案：D. 脂肪細胞（lipocyte）